Clinical trial exclusion criterion:
Selected for neuraxial anesthesia rather than general anesthesia for the open reduction surgery

Entity relations:
- AND("neuraxial anesthesia", "open reduction surgery")
- AND("rather than", "open reduction surgery")
- NOT("rather than", "general anesthesia")